下列關於直接型腹股溝疝氣（direct inguinal hernia）的敘述何者錯誤？
A. 發生於腹壁下動脈（inferior epigastric artery）內側區域
B. 發生於內側腹股溝窩（medial inguinal fossae）
C. 腹腔內構造常由腹股溝深環（deep inguinal ring）脫出
D. 發生於海氏三角（Hesselbach triangle）

正確答案：C. 腹腔內構造常由腹股溝深環（deep inguinal ring）脫出